有關急性中耳炎的併發症，下列敘述何者錯誤？
A. 若產生中耳積水之併發症，可造成聽力暫時的喪失
B. 若發生急性乳突炎（acute mastoiditis），必須住院接受抗生素治療
C. 急性比慢性中耳炎更容易引發腦膜炎或腦膿瘍之併發症
D. 若病人出現頭痛及視乳突水腫（papilledema）時，必須考慮發生側靜脈竇血栓（lateral sinus thrombosis）之併發症

正確答案：C. 急性比慢性中耳炎更容易引發腦膜炎或腦膿瘍之併發症